Clinical trial exclusion criterion:
For subjects enrolled at Indian sites: Moderate or severe acute illness/infection (according to investigator judgment) on the day of vaccination or febrile illness (temperature ≥ 38.0°C).

Entity relations:
- Has_index("on the day of vaccination", "the day of vaccination")
- Has_value("temperature", "≥ 38.0°C")
- Subsumes("febrile illness", "temperature")
- Has_qualifier("acute illness", "Moderate")
- Has_temporal("acute illness", "on the day of vaccination")
- Has_temporal("febrile illness", "on the day of vaccination")
- AND("Indian sites", "febrile illness")
- OR("acute illness", "acute infection")
- OR("Moderate", "severe")